Clinical trial inclusion criterion:
Newly diagnosed glioblastoma (GBM), WHO grade IV.

Entity relations:
- Has_value("WHO", "grade IV")
- Subsumes("glioblastoma", "GBM")
- AND("glioblastoma", "WHO")
- Has_qualifier("glioblastoma", "Newly diagnosed")